Clinical trial inclusion criterion:
Treated hypertensive patients with an average daytime ambulatory blood pressure measurement (ABPM) <150/95mmHg on stable doses of one or more antihypertensive medication (at least one of which should be; an ACE inhibitor, angiotensin receptor blocker or diuretic) for 3 months, or untreated hypertensive patients with an average daytime ABPM =135/85 but <150/95.

Entity relations:
- Has_qualifier("hypertensive", "Treated")
- Has_value("average daytime ambulatory blood pressure measurement (ABPM)", "<150/95mmHg")
- Has_multiplier("antihypertensive medication", "one or more")
- Has_qualifier("antihypertensive medication", "stable doses")
- Has_multiplier("ACE inhibitor", "at least one")
- Subsumes("antihypertensive medication", "ACE inhibitor")
- Has_temporal("stable doses", "for 3 months")
- Has_value("average daytime ABPM", "=135/85 but <150/95")
- Has_qualifier("hypertensive patients", "untreated")
- AND("hypertensive patients", "average daytime ABPM")
- AND("hypertensive", "average daytime ambulatory blood pressure measurement (ABPM)")
- OR("ACE inhibitor", "angiotensin receptor blocker", "diuretic")
- OR("hypertensive", "hypertensive patients")